Clinical trial exclusion criterion:
Mild OSA and patients with BMI over 40 kg/m2.

Annotated entities:
- Condition: "Mild OSA"
- Measurement: "BMI"
- Value: "over 40 kg/m2"